Clinical trial exclusion criterion:
No concurrent use of isoniazid, labetolol, trovafloxacin, tolcapone, and felbamate

Annotated entities:
- Drug: "isoniazid"
- Drug: "labetolol"
- Drug: "trovafloxacin"
- Drug: "tolcapone"
- Drug: "felbamate"
- Negation: "No"